Clinical trial inclusion criterion:
a baseline visual acuity ranging from a letter score of 0 to 70 on the Early Treatment Diabetic Retinopathy Study chart

Entity relations:
- Has_temporal("visual acuity", "baseline")
- Has_value("visual acuity", "letter score of 0 to 70")
- causal("visual acuity", "Early Treatment Diabetic Retinopathy Study chart")